昨天邱醫師晚上值班的時候，因為要同時處理兩個病人的狀況，情況急迫，所以有一個病人使用了口頭醫囑。第 2 天護理站一直打電話催他完成書面紀錄，邱醫師因為還是很忙，就回答說：不要再催了，未完成的病歷不是病人出院 3 天之內完成就好了嗎？等出院再補也不遲。依據醫療法的規定，口頭醫囑應該在幾小時內完成書面紀錄？
A. 1 小時
B. 12 小時
C. 24 小時
D. 48 小時

正確答案：C. 24 小時